Patients unwilling or unable to provide informed consent

The above is a clinical trial exclusion criterion. Annotated with entity spans:
[Informed_consent: Patients unwilling or unable to provide informed consen]t